Patient >18 years of age

The above is a clinical trial inclusion criterion. Annotated with entity spans:
Patient [Value: >18 years] of [Person: age]